Clinical trial inclusion criterion:
Positive sputum culture, identification of bacterial type confirmed Mycobacterium tuberculosis. MGIT drug sensitivity test (DST) results are sensitive of the first-line drugs (isoniazid, streptomycin, rifampicin and ethambutol).

Entity relations:
- Has_value("sputum culture", "Positive")
- Has_qualifier("Mycobacterium tuberculosis", "bacterial type")
- Subsumes("first-line drugs", "isoniazid")
- AND("MGIT drug sensitivity test (DST)", "first-line drugs")
- OR("isoniazid", "rifampicin", "streptomycin", "ethambutol")